Subjects on chronic transfusion program

The above is a clinical trial exclusion criterion. Annotated with entity spans:
Subjects on [Qualifier: chronic] [Procedure: transfusion program]